Clinical trial inclusion criterion:
4. Currently being treated for glaucoma using at least two medications, and be willing to continue on the same regime.

Annotated entities:
- Parsing_Error: "4."
- Condition: "glaucoma"
- Procedure: "treated"
- Temporal: "Currently"
- Multiplier: "at least two"
- Drug: "medications"
- Undefined_semantics: "medications"
- Non-query-able: "willing to continue"